En una Anova de dos vías, la “p” de la interacción (fármaco x edad) es 0,82. ¿Cómo se interpreta?
1. El efecto del fármaco despende de la edad de los pacientes.
2. El fármaco no es efectivo.
3. El fármaco es más efectivo en jóvenes.
4. El efecto del fármaco no depende de la edad de los pacientes.

Respuesta correcta: 4. El efecto del fármaco no depende de la edad de los pacientes.